Cancer with current treatment

The above is a clinical trial exclusion criterion. Annotated with entity spans:
[Condition: Cancer] with [Temporal: current] [Procedure: treatment]